下列關於左心室舒張的敘述，何者正確？
A. 左心室舒張前期（protodiastole）約持續 0.4 秒
B. 左心室開始舒張前，心室內壓力已下降
C. 二尖瓣打開後，左心室即開始等容積舒張（iso-volumetric relaxation）
D. 左心室在等容積舒張時，心室內壓力逐漸上升

正確答案：B. 左心室開始舒張前，心室內壓力已下降